¿Cuál es el destino de las enzimas amilasa y lipasa una vez excretadas al torrente sanguíneo?:
1. Ambas se eliminan por el sistema reticuloendotelial.
2. Ambas se eliminan por el filtrado glomerular y aparecen en orina.
3. Ambas se eliminan por el filtrado glomerular, pero la lipasa se reabsorbe y la amilasa se excreta.
4. Ambas se eliminan por el filtrado glomerular, pero la amilasa se reabsorbe y la lipasa se excreta.

Respuesta correcta: 3. Ambas se eliminan por el filtrado glomerular, pero la lipasa se reabsorbe y la amilasa se excreta.